Clinical trial inclusion criterion:
Primary symptom of chest pain

Entity relations:
- Has_qualifier("chest pain", "Primary symptom")